Clinical trial inclusion criterion:
Provided written consent for participation in the trial prior to any study-specific procedures or requirements.

Entity relations:
- Has_index("prior to any study-specific procedures or requirements", "any study-specific procedures or requirements")
- Has_temporal("written consent for participation in the trial", "prior to any study-specific procedures or requirements")